Clinical trial exclusion criterion:
Psychiatric disease which difficults the adherence to the protocol, such as psychosis, obsessive-compulsive disorders, bipolar disease under treatment, diseases which require treatment with lithium and suicidal ideas in the last 5 years from the inclusion;

Annotated entities:
- Condition: "Psychiatric disease"
- Qualifier: "difficults the adherence to the protocol"
- Subjective_judgement: "difficults the adherence to the protocol"
- Undefined_semantics: "difficults the adherence to the protocol"
- Condition: "psychosis"
- Condition: "obsessive-compulsive disorders"
- Condition: "bipolar disease"
- Qualifier: "under treatment"
- Procedure: "treatment"
- Undefined_semantics: "under treatment"
- Drug: "lithium"
- Procedure: "treatment with lithium"
- Condition: "suicidal ideas"
- Temporal: "in the last 5 years from the inclusion"
- Reference_point: "the inclusion"
- Condition: "diseases which require treatment with lithium"